Age of onset of first episode = 50 years with up to three depressive episodes;

The above is a clinical trial inclusion criterion. Annotated with entity spans:
[Person: Age] of [Condition: onset of first episode] [Value: = 50 years] with up to [Multiplier: three] [Condition: depressive episodes];